¿Cómo se suele obtener el oxígeno en grandes cantidades, a escala industrial?:
1. Se suele preparar por destilación fraccionada del aire.
2. Normalmente se obtiene mediante la electrolisis del agua.
3. Habitualmente se prepara mediante descomposición catalítica del agua oxigenada.
4. Casi siempre se obtiene calentando clorato potásico.

Respuesta correcta: 1. Se suele preparar por destilación fraccionada del aire.